一位 55 歲男性，主訴這 2 個月來感覺很疲倦，胃口不好，手腳麻木感越來越厲害，有時也會拉肚子。理學檢查顯示鞏膜有輕微黃疸，舌頭平滑、味蕾萎縮；全血球檢查顯示血紅素 5.2 g/dL，紅血球 36×106/mm3，MCV 115 fL，白血球 2,290/mm3，分類正常，血小板 34,000/mm3。此位男士最可能是有下列何種狀況？
A. Vit.B12 deficiency
B. Folic acid deficiency
C. Hemolytic anemia
D. Aplastic anemia

正確答案：A. Vit.B12 deficiency